Clinical trial inclusion criterion:
All infertile women treated with intracytoplasmic sperm injection (ICSI)/Fertilization in Vitro and Embryo Transfer (FIVET)

Entity relations:
- OR("intracytoplasmic sperm injection (ICSI)", "Fertilization in Vitro and Embryo Transfer (FIVET)")